有關二期梅毒（secondary syphilis）的臨床表現，下列何者錯誤？
A. 不規則禿髮（moth-eaten hair loss）
B. 軀幹皮膚出現多發性紅色斑塊（roseola syphilitica）
C. 扁平濕疣（condylomata lata）
D. 結節性梅毒腫（nodular gumma）

正確答案：D. 結節性梅毒腫（nodular gumma）